一位 6 歲男童發燒 5 天就診，身體檢查發現上眼皮浮腫、扁桃腺有滲出液（exudate）、肝臟下緣於右肋下方 5 公分、脾臟下緣於左肋下方 3 公分，下列那一種檢查對於診斷最有幫助？
A. Weil-Felix reaction
B. Heterophile antibody test
C. Throat bacteria culture
D. Throat virus culture

正確答案：B. Heterophile antibody test